Clinical trial exclusion criterion:
8. Left main stenosis of 50% or more;

Entity relations:
- Has_value("Left main stenosis", "50% or more")